Clinical trial inclusion criterion:
Accepted for CABG surgery

Entity relations:
- Has_mood("CABG surgery", "Accepted for")